Clinical trial exclusion criterion:
Use of dipyridamole within the last 5 days

Annotated entities:
- Drug: "dipyridamole"
- Temporal: "within the last 5 days"